旋前肌症候群（Pronator syndrome）不是因為下列何種構造壓迫到神經？
A. 深指屈肌（flexor digitorum profundus）
B. Ligament of Struthers
C. Lacertus fibrosus of biceps
D. 旋前圓肌（Pronator teres）

正確答案：A. 深指屈肌（flexor digitorum profundus）